Clinical trial exclusion criterion:
Subjects who, in the opinion of the investigator, are unlikely to cooperate fully during the study

Annotated entities:
- Non-query-able: "Subjects who, in the opinion of the investigator, are unlikely to cooperate fully during the study"